Clinical trial inclusion criterion:
Genotype 1 and 4 infection.

Entity relations:
- Has_value("Genotype", "1 and 4")
- AND("infection", "Genotype")